關於疱疹後神經痛（post-herpetic neuralgia）的敘述，何者錯誤？
A. 好發於老年人
B. 難於治療
C. 提早做交感神經阻斷術可以減少其發生率
D. 在疱疹的急性期給予 acyclovir（抗病毒藥）治療可以減少其發生率

正確答案：D. 在疱疹的急性期給予 acyclovir（抗病毒藥）治療可以減少其發生率